Clinical trial exclusion criterion:
History of any reaction or hypersensitivity likely to be exacerbated by any component of the vaccines.

Annotated entities:
- Condition: "reaction"
- Condition: "hypersensitivity"
- Qualifier: "likely to be exacerbated by any component of the vaccines"
- Drug: "component of the vaccines"